Clinical trial exclusion criteria:
No informed consent for participation in the study, mental illness, which don't allow to obtain informed consent and conduct the treatment according to the protocol
Pregnancy
HIV infection
Active cancer
Active hepatitis virus infection

Annotated entities:
- Non-query-able: "No informed consent for participation in the study, mental illness, which don't allow to obtain informed consent and conduct the treatment according to the protocol"
- Condition: "Pregnancy"
- Condition: "HIV infection"
- Condition: "cancer"
- Temporal: "Active"
- Condition: "hepatitis virus infection"
- Temporal: "Active"